Clinical trial inclusion criteria:
Be categorized as American Society of Anesthesiologists (ASA) Physical Status Class 1, 2, or 3.
Have a planned non-emergent surgical procedure or clinical situation (e.g., intubation) that requires moderate or deep NMB with either rocuronium or vecuronium.
Have a planned surgical procedure or clinical situation that would allow objective neuromuscular monitoring techniques to be applied with access to the arm for neuromuscular transmission monitoring.
Age between 2 to <17 years at Visit 2.
If female, may participate if she is not pregnant, not breastfeeding, and at least one of the following: 1) Not a woman of childbearing potential (WOCBP); or 2) A WOCBP who agrees to follow the study contraceptive guidance during the treatment period and for at least 7 days after the last dose of study treatment.

Annotated entities:
- Measurement: "American Society of Anesthesiologists (ASA) Physical Status Class"
- Value: "1"
- Value: "2"
- Value: "3"
- Mood: "planned"
- Qualifier: "non-emergent"
- Procedure: "surgical procedure"
- Condition: "clinical situation"
- Procedure: "intubation"
- Procedure: "NMB"
- Qualifier: "moderate"
- Qualifier: "deep"
- Drug: "rocuronium"
- Drug: "vecuronium"
- Mood: "planned"
- Procedure: "surgical procedure"
- Condition: "clinical situation"
- Procedure: "objective neuromuscular monitoring techniques"
- Qualifier: "that would allow objective neuromuscular monitoring techniques to be applied"
- Person: "Age"
- Value: "between 2 to <17 years"
- Temporal: "at Visit 2"
- Person: "female"
- Negation: "not"
- Condition: "pregnant"
- Negation: "not"
- Observation: "breastfeeding"
- Multiplier: "at least one"
- Condition: "woman of childbearing potential (WOCBP)"
- Negation: "Not"
- Condition: "WOCBP"
- Procedure: "contraceptive guidance"
- Temporal: "during the treatment period"
- Temporal: "for at least 7 days after the last dose of study treatment"
- Reference_point: "the last dose of study treatment"
- Reference_point: "the treatment period"